¿Cuál es la principal estructura cerebral implicada en el miedo condicionado?:
1. El hipocampo.
2. La corteza cingulada.
3. El bulbo olfatorio.
4. El hipotálamo.
5. La amígdala.

Respuesta correcta: 5. La amígdala.